Clinical trial inclusion criterion:
Poorly managed diet controlled diabetes (with HbA1c > 6.5% , not currently taking any glucose lowering therapy, meeting BMI inclusion range)

Annotated entities:
- Condition: "diabetes"
- Measurement: "HbA1c"
- Value: "> 6.5%"
- Negation: "not"
- Procedure: "glucose lowering therapy"